Clinical trial inclusion criterion:
Patients undergoing an operation that is scheduled to last more than 2 hours

Entity relations:
- Has_qualifier("operation", "scheduled to last more than 2 hours")